Clinical trial inclusion criteria:
diagnosed with PD by a neurologist (Fahn and Elton, 1987);
aged 30 to 85 years;
at modified Hoehn and Yahr (H&Y) stage 1.5 to 3 (Hoehn and Yahr ,1967; Goetz et al., 2004);
able and willing to give written consent for participation in the study;
living at home in the community;
able to walk independently for 30 metres with or without an assistive device.

Annotated entities:
- Condition: "PD"
- Qualifier: "by a neurologist"
- Non-query-able: "by a neurologist"
- Person: "aged"
- Value: "30 to 85 years"
- Measurement: "modified Hoehn and Yahr (H&Y)"
- Value: "stage 1.5 to 3"
- Non-query-able: "able and willing to give written consent for participation in the study;"
- Post-eligibility: "able and willing to give written consent for participation in the study;"
- Observation: "living at home in the community"
- Condition: "able to walk independently with or without an assistive device"
- Multiplier: "for 30 metres"